Clinical trial inclusion criterion:
Acquired acute ankle injury (injured less than 48 hours ago);

Entity relations:
- Has_temporal("acute ankle injury", "less than 48 hours ago")
- Has_qualifier("acute ankle injury", "Acquired")